Clinical trial exclusion criterion:
Creatinine >= 2 x upper limit of normal (ULN)

Annotated entities:
- Measurement: "Creatinine"
- Value: ">= 2 x upper limit of normal (ULN)"